Patients who have had a major life event in the past three months, which in the judgement of the investigator is influencing their current condition.

The above is a clinical trial exclusion criterion. Annotated with entity spans:
[Non-query-able: Patients who have had a major life event in the past three months, which in the judgement of the investigator is influencing their current condition].